In the investigator's opinion, the subject still has significant intraretinal fluid with room for improvement in both macular edema and BCVA.

The above is a clinical trial inclusion criterion. Annotated with entity spans:
[Non-query-able: In the investigator's opinion], the subject still has [Qualifier: significant] [Condition: intraretinal fluid] [Qualifier: with room for improvement] in both [Condition: macular edema] and [Condition: BCVA].